¿Con qué concepto etológico se vincula el fenómeno del “apego”?
1. Señales disparadoras.
2. Troquelado.
3. Patrones fijos de adaptación.
4. El fenómeno reverie.
5. Las pulsiones.

Respuesta correcta: 2. Troquelado.